Serious heart insufficiency, liver insufficiency, renal insufficiency and other serious medical problems

The above is a clinical trial exclusion criterion. Annotated with entity spans:
[Qualifier: Serious] [Condition: heart insufficiency], [Condition: liver insufficiency], [Condition: renal insufficiency] and [Qualifier: other] [Condition: serious medical problems]